Clinical trial exclusion criterion:
Test positive at screening for human immunodeficiency virus (HIV), hepatitis B surface antigen (HbsAg), or hepatitis C virus (HCV)

Entity relations:
- Has_value("human immunodeficiency virus (HIV)", "positive")
- Has_temporal("human immunodeficiency virus (HIV)", "at screening")
- OR("human immunodeficiency virus (HIV)", "hepatitis B surface antigen (HbsAg)", "hepatitis C virus (HCV)")